Clinical trial inclusion criterion:
Willingness to eat a chocolate-flavored snack at test sessions and two week training period

Entity relations:
- Has_temporal("Willingness to eat a chocolate-flavored snack", "at two week training period")
- Has_temporal("Willingness to eat a chocolate-flavored snack", "at test sessions")